Clinical trial exclusion criterion:
The subject or any of their healthcare providers is aware of the subjects HLA type.

Annotated entities:
- Non-query-able: "The subject or any of their healthcare providers is aware of the subjects HLA type"